interferon ß-1b,

The above is a clinical trial inclusion criterion. Annotated with entity spans:
[Drug: interferon ß-1b],